一位40歲女性乳癌病人，手術後經過6次化學治療包括5-fluorouracil，methotrexate和cyclophosphamide，此位病人長期最可能發生的副作用為何？
A. 心臟毒性
B. 白血病
C. 提早停經
D. 神經毒性

正確答案：C. 提早停經